下列何者最不可能是新生兒全靜脈營養之合併症？
A. 管路感染
B. 膽汁鬱積（cholestasis）
C. 肝臟功能異常
D. 腎臟功能異常

正確答案：D. 腎臟功能異常